Clinical trial exclusion criterion:
Inability to discontinue oral anticoagulant 2-5 days prior to study treatment

Entity relations:
- Has_index("2-5 days prior to study treatment", "study treatment")